Clinical trial inclusion criterion:
angiographic stenosis>50% or occlusion of at least one tibial vessel of at least 40mm for which an interventional treatment is scheduled

Entity relations:
- Has_mood("interventional treatment", "scheduled")
- Has_qualifier("tibial vessel", "at least 40mm")
- Has_multiplier("tibial vessel", "at least one")
- Has_qualifier("occlusion", "tibial vessel")
- Has_value("angiographic stenosis", ">50%")
- AND("occlusion", "interventional treatment")